Clinical trial inclusion criterion:
Normal semen analysis and mild/moderate male factor (Total motile sperm count > 5 million/ml and/or normal WHO morphology >20%.

Entity relations:
- Has_qualifier("male factor", "mild")
- Has_value("Total motile sperm count", "> 5 million/ml")
- Has_value("normal WHO morphology", ">20%")
- Subsumes("male factor", "Total motile sperm count")
- OR("mild", "moderate")
- OR("Total motile sperm count", "normal WHO morphology")